Clinical trial inclusion criteria:
Patients 18 years of age or older with >3 unformed stools/24 hours with positive stool test for C. difficile.
Patients receiving = 1 high or medium risk antibiotic for treatment of an infection other than CDI, for an anticipated duration of = 5 days from the time of enrollment.

Annotated entities:
- Person: "age"
- Value: "or older 18 years"
- Multiplier: ">3"
- Observation: "unformed stools"
- Temporal: "24 hours"
- Measurement: "stool test"
- Value: "positive"
- Qualifier: "C. difficile"
- Non-query-able: "Patients receiving = 1 high or medium risk antibiotic for treatment of an infection other than CDI, for an anticipated duration of = 5 days from the time of enrollment."